Has an indication for implantation of a single or dual chamber ICD or CRT-D system in their respective geography

The above is a clinical trial inclusion criterion. Annotated with entity spans:
Has an [Observation: indication] for implantation of a single or [Procedure: dual chamber ICD] or [Procedure: CRT-D system] in their respective geography